Clinical trial inclusion criterion:
Normal semen analysis and mild/moderate male factor (Total motile sperm count > 5 million/ml and/or normal WHO morphology >20%.

Annotated entities:
- Measurement: "semen analysis"
- Condition: "male factor"
- Qualifier: "moderate"
- Qualifier: "mild"
- Measurement: "Total motile sperm count"
- Value: "> 5 million/ml"
- Measurement: "normal WHO morphology"
- Value: ">20%"